Clinical trial exclusion criterion:
Compromised ability of the patient to give written informed consent and/or to comply with study procedures

Annotated entities:
- Condition: "Compromised ability"
- Informed_consent: "give written informed consent"
- Non-representable: "comply with study procedures"